age 18-65 years

The above is a clinical trial inclusion criterion. Annotated with entity spans:
[Person: age] [Value: 18-65 years]